在先天矯正性之大動脈血管轉位症（congenitally corrected transposition of great arteries）中，較常見之 SLL 型（Situs solitus, L-loop, L-Transposition）若合併有心室中隔缺損，則其傳導組織位於何處？
A. 位於心室中隔缺損之上緣
B. 位於心室中隔缺損之下緣
C. 和一般心室中隔缺損相同在後下緣
D. 心室中隔缺損邊緣和傳導組織相隔甚遠

正確答案：A. 位於心室中隔缺損之上緣